4. Currently being treated for glaucoma using at least two medications, and be willing to continue on the same regime.

The above is a clinical trial inclusion criterion. Annotated with entity spans:
[Parsing_Error: 4.] [Temporal: Currently] being [Procedure: treated] for [Condition: glaucoma] using [Multiplier: at least two] [Drug: medications], and be [Non-query-able: willing to continue] on the same regime.